11. Use of colchicine, methotrexate, azathioprine, or systemic steroids in the two months preceding screening

The above is a clinical trial exclusion criterion. Annotated with entity spans:
[Parsing_Error: 11.] Use of [Drug: colchicine], [Drug: methotrexate], [Drug: azathioprine], or [Drug: systemic steroids] [Temporal: in the two months preceding screening]